How does condensin affect the function of topoisomeraseII?

Condensin prevents deleterious anaphase bridges during chromosome segregation by promoting sister chromatid decatenation which are created by topoisomerase II. Condensin-dependent localisation of topoisomerase II to an axial chromosomal structure is required for sister chromatid resolution during mitosis.